下列生長因子（growth factors），何者沒有血管新生（angiogenesis）的作用？
A. 血小板衍生之生長因子 Platelet-derived growth factor
B. 白血球衍生之生長因子 Leukocyte-derived growth factor
C. β-變形生長因子 Transforming growth factor-beta
D. α-腫瘤壞死因子 Tumor necrosis factor-alpha

正確答案：B. 白血球衍生之生長因子 Leukocyte-derived growth factor